Clinical trial inclusion criterion:
Evaluable Disease in the Phase I, and measurable disease in the Phase II

Annotated entities:
- Condition: "Disease"
- Qualifier: "Evaluable"
- Temporal: "in the Phase I"
- Temporal: "in the Phase II"
- Qualifier: "measurable"